What is  Achondroplasia?

achondrogenesis type ii is an autosomal-dominant disease to severe micromelic dwarfism. .